Clinical trial inclusion criterion:
ECOG (Eastern Cooperative Oncology Group)score: 0-2

Annotated entities:
- Measurement: "ECOG (Eastern Cooperative Oncology Group)score"
- Value: "0-2"